Clinical trial exclusion criterion:
1. bilateral AT

Annotated entities:
- Condition: "bilateral AT"